一位 70 歲男性病人因肺炎住進加護病房，經插氣管內管，給予氧氣和呼吸器輔助呼吸後，動脈血檢 查（給予 FiO2 60%）PaO2 = 60 mmHg，PaCO2 = 32 mmHg，pH = 7.38，胸部 X 光片顯示兩側肺炎浸
 潤明顯，下列敘述和處置何者最正確？
A. 病況尚未演變成急性呼吸窘迫症候群（acute respiratory distress syndrome，ARDS）
B. 呼吸器初始設定建議給予 12 mL/kg predicted body weight，對病患較有幫助
C. 經給予廣效性抗生素，大部分病人在 7 天內可改善，並脫離呼吸器
D. 死亡率約在 26～44%間，且大多非因肺部原因而死亡

正確答案：D. 死亡率約在 26～44%間，且大多非因肺部原因而死亡